History of delirium within the prior 3 months, epilepsy, stroke, dementia, psychotic disorder, or bipolar disorder

The above is a clinical trial exclusion criterion. Annotated with entity spans:
History of [Condition: delirium] [Temporal: within the prior 3 months], [Condition: epilepsy], [Condition: stroke], [Condition: dementia], [Condition: psychotic disorder], or [Condition: bipolar disorder]